Clinical trial inclusion criterion:
Symptomatic anemia (hemoglobin <10 g/dL) as determined by investigator

Annotated entities:
- Condition: "anemia"
- Qualifier: "Symptomatic"
- Measurement: "hemoglobin"
- Value: "<10 g/dL"